Clinical trial exclusion criterion:
Frank psychosis

Entity relations:
- Has_qualifier("psychosis", "Frank")